Which diseases are associated with Primary intestinal lymphangiectasia (PIL)?

Primary intestinal lymphangiectasia (PIL) is associated with:
1) Waldmann's disease and
2) Hennekam syndrome (HS).